What is the use of the Canadian C-Spine Rule?

The Canadian C-spine rule clinically clears cervical spine fracture without imaging.